Untreated adrenal insufficiency.

The above is a clinical trial exclusion criterion. Annotated with entity spans:
[Qualifier: Untreated] [Condition: adrenal insufficiency].